Clinical trial exclusion criterion:
11. Systolic blood pressure < 90mmHg, or > 160mmHg;

Annotated entities:
- Measurement: "blood pressure"
- Value: "< 90mmHg"
- Value: "> 160mmHg"